Advanced solid tumor malignancy (during expansion at the maximum tolerated dose, entry will be limited to patients wtih adenocarcinoma of the colon or rectum)

The above is a clinical trial inclusion criterion. Annotated with entity spans:
[Condition: Advanced solid tumor malignancy] ([Parsing_Error: during expansion at the maximum tolerated dose, entry will be limited to patients wtih adenocarcinoma of the colon or rectum])